下列關於人類細胞內受質階層磷酸化（substrate-level phosphorylation）與氧化磷酸化（oxidative phosphorylation）生化反應進行之位點（compartments）分布，何者正確？
A. 受質階層磷酸化只在粒線體中進行，氧化磷酸化在細胞質中進行
B. 受質階層磷酸化只在細胞質中進行，氧化磷酸化在粒線體中進行
C. 受質階層磷酸化可分別在細胞質及粒線體中進行，氧化磷酸化在粒線體中進行
D. 受質階層磷酸化與氧化磷酸化皆只在粒線體中進行

正確答案：C. 受質階層磷酸化可分別在細胞質及粒線體中進行，氧化磷酸化在粒線體中進行